Patients who previously participated in any Aliskiren study.

The above is a clinical trial exclusion criterion. Annotated with entity spans:
Patients who [Temporal: previously] participated in any [Competing_trial: Aliskiren study].